Clinical trial inclusion criteria:
Patients are able to provide signed and dated written informed consent prior to any study specific procedures.
Women are post-menopausal (defined as at least 1 year post cessation of menses) and aged = 45 and = 70 years. Males are aged = 40 years and = 70 years. Patients should have suitable veins for cannulation or repeated venipuncture.
Patients are diagnosed with T2DM for at least the last 6 months.
Patients are on no other anti-diabetic drug treatment, or on stable maximum 3000 mg daily dose metformin treatment and/or on stable dose of a DPPIV inhibitor treatment for at least the last 3 months5. HbA1c levels =6.0% (=42 mmol/mol) and =9.0% (75 mmol/mol).
Have a body mass index (BMI) = 35 kg/m2.

Annotated entities:
- Informed_consent: "Patients are able to provide signed and dated written informed consent prior to any study specific procedures."
- Person: "Women"
- Condition: "post-menopausal"
- Temporal: "as at least 1 year post cessation of menses"
- Reference_point: "cessation of menses"
- Person: "aged"
- Value: "= 45 and = 70 years"
- Person: "Males"
- Person: "aged"
- Value: "= 40 years and = 70 years"
- Non-representable: "Patients should have suitable veins for cannulation or repeated venipuncture."
- Condition: "T2DM"
- Temporal: "for at least the last 6 months"
- Procedure: "anti-diabetic drug treatment"
- Negation: "no"
- Qualifier: "other"
- Qualifier: "stable"
- Multiplier: "maximum 3000 mg daily dose"
- Drug: "metformin"
- Qualifier: "stable dose"
- Drug: "DPPIV inhibitor"
- Temporal: "for at least the last 3 months"
- Measurement: "HbA1c levels"
- Value: "=6.0%"
- Value: "=42 mmol/mol"
- Value: "=9.0%"
- Value: "75 mmol/mol"
- Measurement: "body mass index (BMI)"
- Value: "= 35 kg/m2"